What is the mode of action of teriparatide?

Teripartide is is an effective anabolic (i.e., bone growing) agent used in the treatment of some forms of osteoporosis.